Therapy area located outside of head and neck;

The above is a clinical trial exclusion criterion. Annotated with entity spans:
[Non-representable: Therapy area located outside of head and neck;]